Clinical trial exclusion criterion:
Congestive heart failure (NYHA II-IV).

Annotated entities:
- Condition: "Congestive heart failure"
- Measurement: "NYHA"
- Value: "II-IV"